Where is the yeast transpozable element Ty3 preferentially inserted?

Ty3 inserts at transcription initiation sites of genomic tRNA genes and plasmid-borne 5S and U6 RNA genes transcribed by RNA polymerase III.